Clinical trial exclusion criterion:
any type of steroid in regular use

Entity relations:
- Has_multiplier("steroid", "regular use")